Clinical trial inclusion criteria:
Histologically or cytologically confirmed adenocarcinoma of the breast with locally advanced or metastatic disease, and a candidate for chemotherapy.
Human epidermal growth factor receptor 2 (HER2)-positive.
No prior chemotherapy for their metastatic breast cancer (MBC).
Measurable disease.
Age ≥ 18 years.
For women of childbearing potential and men with partners of childbearing potential, agreement to use a highly effective, non-hormonal form of contraception or 2 effective forms of non-hormonal contraception by the patient and/or partner. Contraception use must continue for the duration of study treatment and for at least 6 months after the last dose of study treatment. Male patients whose partners are pregnant should use condoms for the duration of the study.

Annotated entities:
- Qualifier: "cytologically confirmed"
- Qualifier: "Histologically confirmed"
- Condition: "adenocarcinoma of the breast"
- Condition: "metastatic disease"
- Condition: "disease locally advanced"
- Condition: "candidate for chemotherapy"
- Procedure: "chemotherapy"
- Measurement: "Human epidermal growth factor receptor 2 (HER2)"
- Value: "positive"
- Procedure: "chemotherapy"
- Temporal: "prior"
- Negation: "No"
- Condition: "metastatic breast cancer (MBC)"
- Condition: "Measurable disease"
- Person: "Age"
- Value: "≥ 18 years"
- Person: "women"
- Condition: "childbearing potential"
- Person: "men"
- Observation: "with partners of childbearing potential"
- Qualifier: "highly effective"
- Qualifier: "non-hormonal"
- Procedure: "contraception"
- Multiplier: "2"
- Procedure: "non-hormonal contraception"
- Procedure: "Contraception"
- Temporal: "continue for the duration of study treatment"
- Reference_point: "study treatment"
- Temporal: "for at least 6 months after the last dose of study treatment"
- Reference_point: "the last dose of study treatment"
- Person: "Male"
- Observation: "partners are pregnant"
- Device: "condoms"
- Temporal: "for the duration of the study"